Clinical trial inclusion criterion:
In the Investigator's opinion, is able and willing to comply with all trial requirements.

Annotated entities:
- Post-eligibility: "In the Investigator's opinion, is able and willing to comply with all trial requirements"